腦下垂體後葉不含下列何項構造？
A. 有孔微血管
B. 神經膠細胞
C. 無髓鞘神經纖維
D. 有髓鞘神經纖維

正確答案：D. 有髓鞘神經纖維